Los grupos con efecto resonante electrodonador son:
1. Desactivantes y orto/para-dirigentes.
2. Activantes y orto/para-dirigentes.
3. Desactivantes y meta-dirigentes.
4. Activantes y meta-dirigentes.
5. Desactivantes y no orientan a ninguna posición.

Respuesta correcta: 2. Activantes y orto/para-dirigentes.